WBC >_3500/mm3, platelet count >_100,000/mm3.

The above is a clinical trial inclusion criterion. Annotated with entity spans:
[Measurement: WBC] [Value: >_3500/mm3], [Measurement: platelet count] [Value: >_100,000/mm3].